Clinical trial inclusion criterion:
Physically and neurologically healthy [confirmed by a comprehensive medical history]

Entity relations:
- AND("healthy Physically", "comprehensive medical history")
- AND("neurologically healthy", "comprehensive medical history")